¿Cuál de los siguientes complejos enzimáticos cataliza de la reducción del oxígeno a agua durante el transporte electrónico?
1. ATP sintasa.
2. Citocromo oxidasa.
3. NADH deshidrogenasa.
4. Ubiquinona:citocromo c oxidorreductasa.

Respuesta correcta: 2. Citocromo oxidasa.